Diagnosis of primary progressive MS

The above is a clinical trial exclusion criterion. Annotated with entity spans:
Diagnosis of [Qualifier: primary] [Condition: progressive MS]